Height < 4' 11"

The above is a clinical trial exclusion criterion. Annotated with entity spans:
[Measurement: Height] [Value: < 4' 11"]